Age between 18 and 65 years.

The above is a clinical trial inclusion criterion. Annotated with entity spans:
[Person: Age] [Value: between 18 and 65 years].